Clinical trial exclusion criterion:
Take any Alpha-Methyldopa, Clonodine, Other Alpha-2 Adrenergic Agonist

Entity relations:
- Has_qualifier("Alpha-2 Adrenergic Agonist", "Other")
- OR("Alpha-Methyldopa", "Alpha-2 Adrenergic Agonist", "Clonodine")